Clinical trial exclusion criterion:
Babies who have been close to death

Entity relations:
- Has_temporal("close to death", "have been")